Clinical trial exclusion criterion:
Life expectancy under 6 months

Annotated entities:
- Observation: "Life expectancy"
- Value: "under 6 months"